DSM-IV diagnosis of Alcohol or Substance Abuse within the last one month (except nicotine) or DSM-5 diagnosis of Substance Use Disorder in the last six months (except nicotine)

The above is a clinical trial exclusion criterion. Annotated with entity spans:
[Qualifier: DSM-IV] diagnosis of [Condition: Alcohol] or [Condition: Substance Abuse] [Temporal: within the last one month] ([Negation: except] [Drug: nicotine]) or [Qualifier: DSM-5] diagnosis of [Condition: Substance Use Disorder] [Temporal: in the last six months] ([Negation: except] [Drug: nicotine])